Patients with a history of drug abuse;

The above is a clinical trial exclusion criterion. Annotated with entity spans:
Patients with a [Temporal: history] of [Condition: drug abuse];